La red citoesquelética del glóbulo rojo está constituida por filamentos cortos de actina unidos mediante:
1. Miosina.
2. Tropomiosina.
3. Espectrina.
4. Fimbrina.

Respuesta correcta: 3. Espectrina.